Paciente con diagnóstico de VIH sin antecedentes neurológicos previos que es derivado al servicio de Urgencias por episodio de crisis convulsiva. ¿Cuál es la etiología MENOS probable?
1. Leucoencefalopatía multifocal progresiva.
2. Meningitis criptocócica.
3. Encefalopatía VIH.
4. Linfoma primario del SNC.

Respuesta correcta: 1. Leucoencefalopatía multifocal progresiva.